Clinical trial inclusion criterion:
Body mass index >85%ile for age and sex by standard growth charts;

Annotated entities:
- Measurement: "Body mass index"
- Value: ">85%ile"